Clinical trial exclusion criterion:
any previous treatment for the for adhesive capsulitis of the affected shoulder.

Annotated entities:
- Qualifier: "any"
- Temporal: "previous"
- Procedure: "treatment"
- Condition: "adhesive capsulitis"
- Qualifier: "affected shoulder"